Clinical trial exclusion criterion:
Subjects who refuse to subscribe written informed consents or can't cooperate with the trial well.

Annotated entities:
- Observation: "refuse to subscribe written informed consents"
- Observation: "can't cooperate with the trial"